65 歲之抽菸患者，因長期咳嗽有痰及呼吸困難已有三年而前來求診，試問下列何者檢查在診斷此病患為慢性阻塞性肺疾最有價值？
A. 胸部 X 光片
B. 肺功能檢查
C. 動脈血液氣體分析
D. 心電圖檢查

正確答案：B. 肺功能檢查